Clinical trial exclusion criterion:
Sleep apnea by polysomnography

Annotated entities:
- Condition: "Sleep apnea"
- Procedure: "polysomnography"